Clinical trial inclusion criterion:
Adolescent (10-21 years) undergoing spinal fusion for idiopathic scoliosis, spondylolisthesis or Scheuermann kyphosis.

Annotated entities:
- Person: "Adolescent"
- Value: "10-21 years"
- Person: "years"
- Procedure: "spinal fusion"
- Condition: "idiopathic scoliosis"
- Condition: "spondylolisthesis"
- Condition: "Scheuermann kyphosis"